Clinical trial exclusion criterion:
RIF (repeated implantation failure), defined as greater than or equals to (>=) 2 previous failed embryo transfers

Annotated entities:
- Condition: "RIF (repeated implantation failure)"
- Value: "greater than or equals to (>=) 2"
- Measurement: "previous failed embryo transfers"